Clinical trial exclusion criterion:
Planning to become pregnant in the next 2 years.

Annotated entities:
- Pregnancy_considerations: "Planning to become pregnant in the next 2 years."